目前腎臟移植的捐贈者條件已經越來越寬鬆，但一般而言，以下何者仍不建議成為捐贈者？
A. 62 歲，無特殊病史
B. 56 歲，高血壓患者
C. 45 歲，乳癌併肺轉移
D. 50 歲，糖尿病患者

正確答案：C. 45 歲，乳癌併肺轉移